Clinical trial inclusion criterion:
Bilateral symmetrically impacted lower third molars according to Pel-Gregory's and Winter's classification

Annotated entities:
- Measurement: "Pel-Gregory's and Winter's classification"
- Value: "Bilateral symmetrically impacted lower third molars"